Clinical trial exclusion criterion:
Subjects were not to have had treatment with any known enzyme-altering agents (barbiturates, phenothiazines, cimetidine etc.) within 30 days prior to or during the study.

Annotated entities:
- Drug: "enzyme-altering agents"
- Drug: "barbiturates"
- Drug: "phenothiazines"
- Drug: "cimetidine"
- Temporal: "within 30 days prior to or during the study"